Clinical trial exclusion criterion:
9. self-reported pregnancy

Annotated entities:
- Condition: "pregnancy"